What condition is usually represented by the acronym SUDEP?

The acronym SUDEP refers to  Sudden Unexpected Death in Epilepsy